Concomitant use of strong CYP 3A inhibitors or inducers

The above is a clinical trial exclusion criterion. Annotated with entity spans:
Concomitant use of [Drug: strong CYP 3A inhibitors] or inducers